有關正常懷孕與子宮外孕的敘述，下列何者錯誤？
A. 正常懷孕時，β-hCG 濃度大於 1500 mIU/mL 時，陰道超音波可看到子宮內的妊娠囊
B. 正常早期懷孕，β-hCG 每天會上升一倍，如果上升速率較慢，必須懷疑有子宮外孕的可能性
C. 子宮外孕最常見到的位置是兩側輸卵管
D. 子宮外孕若早期發現，胚胎尚未破掉且還沒有心跳時，可以考慮化學藥物治療，給Methotrexate

正確答案：B. 正常早期懷孕，β-hCG 每天會上升一倍，如果上升速率較慢，必須懷疑有子宮外孕的可能性